Clinical trial exclusion criterion:
Current use of opioid drugs

Annotated entities:
- Drug: "opioid"